下列何種酵素位於小腸上皮細胞膜上並負責消化蛋白質食物？
A. 胺基胜肽酶（aminopeptidase）
B. 羧基胜肽酶（carboxypeptidase）
C. 胰凝乳蛋白酶（chymotrypsin）
D. 胰蛋白酶（trypsin）

正確答案：A. 胺基胜肽酶（aminopeptidase）